What is the normal function p53?

Wild-type p53 can suppress tumour development by multiple pathways.